Subjects with evidence of liver cirrhosis

The above is a clinical trial exclusion criterion. Annotated with entity spans:
Subjects with [Mood: evidence] of [Condition: liver cirrhosis]